Clinical trial exclusion criteria:
Allergic to study drugs
Patient with asthma or COPD, patient who is severely respiratory depressed
Renal of hepatic insufficiency
Epileptic status
Intracranial lesion associated with increased intracranial pressure
Acute abdomen, patient who has diagnosed paralytic ileus or suspicious ileus
Pregnant or lactating women

Annotated entities:
- Condition: "Allergic"
- Drug: "study drugs"
- Condition: "asthma"
- Condition: "COPD"
- Qualifier: "severely"
- Condition: "respiratory depressed"
- Condition: "hepatic insufficiency"
- Condition: "Renal insufficiency"
- Condition: "Epileptic status"
- Condition: "Intracranial lesion"
- Measurement: "intracranial pressure"
- Value: "increased"
- Condition: "Acute abdomen"
- Condition: "paralytic ileus"
- Condition: "suspicious ileus"
- Condition: "Pregnant"
- Condition: "lactating"
- Person: "wome"